Clinical trial exclusion criterion:
Any cardiac surgery within the past 60 days (2 months) or valvular cardiac surgical procedure at any time (i.e., ventriculotomy, atriotomy, and valve repair or replacement and presence of a prosthetic valve)

Annotated entities:
- Procedure: "cardiac surgery"
- Temporal: "within the past 60 days"
- Temporal: "2 months"
- Procedure: "valvular cardiac surgical"
- Procedure: "ventriculotomy"
- Procedure: "atriotomy"
- Procedure: "valve repair"
- Procedure: "valve replacement"
- Device: "prosthetic valve)"